Clinical trial inclusion criterion:
American Society of Anesthesiologist (ASA) status I-II adult patients undergoing elective laparoscopic cholecystectomy.

Annotated entities:
- Measurement: "American Society of Anesthesiologist (ASA)"
- Value: "status I-II"
- Person: "adult"
- Qualifier: "elective"
- Procedure: "laparoscopic cholecystectomy"